Unable to go to clinic visit.

The above is a clinical trial exclusion criterion. Annotated with entity spans:
[Observation: Unable] to [Observation: go to clinic visit].